La Tendencia de respuesta es una importante fuente de error que merman la calidad de:
1. Las técnicas Proyectivas.
2. La Entrevista semiestructurada.
3. La metodología de la Observación.
4. Los Autoinformes.
5. Las Técnicas Objetivas.

Respuesta correcta: 4. Los Autoinformes.